一位 33 歲女性 G4P3，因為陰道出血至急診室求醫，病人自述根據月經週期，目前妊娠 12 週，檢查後血壓 110/70 mmHg，心率 88 下/分鐘，血紅素：9.6 g/dL，β-hCG：35,000 mIU/mL。超音波發現子宮內無胎兒但有囊泡狀物，最佳的治療是：
A. 子宮切除（hysterectomy）
B. 子宮擴刮術（dilation & curettage）
C. 化學治療
D. 放射線治療

正確答案：B. 子宮擴刮術（dilation & curettage）